Clinical trial inclusion criterion:
Human epidermal growth factor receptor 2 (HER2)-positive.

Entity relations:
- Has_value("Human epidermal growth factor receptor 2 (HER2)", "positive")